一位 50 歲男士有缺鐵性貧血病史，因左鎖骨上腫塊求診，經病理切片診斷為轉移性腺癌與戒環細胞分化（signet ring cell differentiation）。在這個階段最適當的檢查為：
A. 上消化道內視鏡
B. 胸部 CT 掃描
C. 骨掃描
D. PET 掃描

正確答案：A. 上消化道內視鏡